Clinical trial exclusion criterion:
History of having received any systemic anti-neoplastic (including radiation) or immunomodulatory treatment (including systemic corticosteroids) <=6 months prior to the first dose of study drug or the expectation that such treatment will be needed at any time during the study.

Entity relations:
- Subsumes("anti-neoplastic treatment", "radiation")
- Has_qualifier("corticosteroids", "systemic")
- Has_qualifier("anti-neoplastic treatment", "systemic")
- Subsumes("immunomodulatory treatment", "corticosteroids")
- Has_index("<=6 months prior to the first dose of study drug", "the first dose of study drug")
- Has_temporal("anti-neoplastic treatment", "<=6 months prior to the first dose of study drug")
- Has_mood("treatment", "expectation")
- Has_mood("treatment", "will be needed")
- Has_temporal("treatment", "at any time during the study")
- OR("anti-neoplastic treatment", "immunomodulatory treatment")
- OR("anti-neoplastic treatment", "treatment")